Los desmosomas:
1. Comunican los citoplasmas de células contiguas.
2. Sellan el espacio intercelular.
3. Rodean todo el perímetro celular.
4. Unen la célula a la lámina basal.
5. Son uniones adhesivas intercelulares puntuales.

Respuesta correcta: 5. Son uniones adhesivas intercelulares puntuales.